下列何者不可作為過敏性鼻炎長期維持性治療藥物？
A. 鼻內類固醇噴劑（corticosteroids）
B. 鼻內去充血噴劑（decongestants）
C. 鼻內色甘酸鈉噴劑（cromolyn sodium）
D. 鼻內抗組織胺噴劑（antihistamines）

正確答案：B. 鼻內去充血噴劑（decongestants）